Clinical trial exclusion criterion:
Concern for inability of the patient to comply with study procedures and/or follow up (eg, alcohol or drug abuse)

Annotated entities:
- Observation: "inability to comply with study procedures"
- Observation: "inability to comply with follow up"
- Condition: "alcohol abuse"
- Condition: "drug abuse"
- Mood: "Concern for"